Ante una gasometría extraída respirando aire ambiente a nivel del mar con pH 7,44, PaO2 55 mmHg y PaCO2 33 mmHg, ¿cuál de los siguientes diagnósticos es MENOS probable?
1. Insuficiencia cardiaca.
2. Neumotórax.
3. Sobredosis de benzodiacepinas.
4. Intoxicación por monóxido de carbono.

Respuesta correcta: 3. Sobredosis de benzodiacepinas.